Clinical trial exclusion criterion:
Women with active thromboembolic disorders

Entity relations:
- Has_qualifier("thromboembolic disorders", "active")